家族性皮質下腦梗塞（familial subcortical infarction, CADASIL）之可能相關基因為何？
A. protein C
B. protein S
C. notch3
D. mtDNA

正確答案：C. notch3